Clinical trial inclusion criterion:
All patients admitted to the ICU in septic shock

Entity relations:
- AND("admitted", "ICU")